Clinical trial exclusion criterion:
Intracranial bleed at any point.

Annotated entities:
- Condition: "Intracranial bleed"
- Temporal: "at any point"